18 歲男性，打電玩時發生右胸疼痛、呼吸急促。理學檢查發現：血壓 90/50 mmHg、呼吸速率每分鐘 28 次、氣管向左側偏移、右胸呼吸聲減弱、觸診可見右胸呼吸無起伏、叩診為右胸回音增加（ hyperresonance）。有關這位病患之診斷與治療，下列何者正確？
A. 為右側大量肋膜積水，應考慮胸腔引流術
B. 為右側肺部塌陷，考慮姿勢引流
C. 為右胸壓力性氣胸，應考慮立即放置胸管
D. 為右側氣胸，可以先觀察一段時間再決定下一步之處置

正確答案：C. 為右胸壓力性氣胸，應考慮立即放置胸管